Clinical trial exclusion criterion:
ketoacidosis with a Base Excess >=2

Annotated entities:
- Condition: "ketoacidosis"
- Measurement: "Base Excess"
- Value: ">=2"